Oral anticoagulation with International Normalized Ratio (INR) > 2

The above is a clinical trial exclusion criterion. Annotated with entity spans:
[Procedure: Oral anticoagulation] with [Measurement: International Normalized Ratio (INR)] [Value: > 2]